關於惡性高血壓（malignant hypertension）的腎臟病理變化，下列何者最不適當？
A. 細動脈類纖維蛋白壞死（fibrinoid necrosis of arterioles）
B. 增生性細動脈炎（hyperplastic arteriolitis）
C. 腎小球壞死或血栓變化（necrotic or thrombotic changes in glomeruli）
D. 玻璃質細動脈硬化（hyaline arteriolosclerosis）

正確答案：D. 玻璃質細動脈硬化（hyaline arteriolosclerosis）